Pregnant woman whose amniocentesis reveals any genetic abnormality

The above is a clinical trial exclusion criterion. Annotated with entity spans:
[Condition: Pregnant] [Person: woman] whose [Procedure: amniocentesis] reveals any [Value: genetic abnormality]